Clinical trial exclusion criterion:
Serum potassium < 3.5 or > 5.1 mEq/L

Annotated entities:
- Measurement: "Serum potassium"
- Value: "< 3.5"
- Value: "> 5.1 mEq/L"